TPN cholestasis of at least 2.5 mg/dl

The above is a clinical trial inclusion criterion. Annotated with entity spans:
[Condition: TPN cholestasis] of [Multiplier: at least 2.5 mg/dl]